Clinical trial exclusion criterion:
Serum potassium level = 5.5 mEq/L

Annotated entities:
- Measurement: "Serum potassium level"
- Value: "= 5.5 mEq/L"